一位 32 歲男性，檢查發現左側睪丸有一個約 4 公分大小的實心腫瘤。進一步檢查發現在腹部主動脈旁有數個腫大的淋巴結，且兩側肺部也有許多小結節存在。血液檢查發現人類絨毛膜促性腺激素（human chorionic gonadotropin; HCG）與甲型胎兒蛋白（alpha-fetoprotein）濃度明顯上升。下列何者是最可能的診斷？
A. 精細胞瘤（seminoma）
B. 混合生殖細胞瘤（mixed germ cell tumor）
C. 雷迪氏細胞瘤（Leydig cell tumor）
D. 瀰漫性大細胞淋巴瘤（diffuse large B cell lymphoma）

正確答案：B. 混合生殖細胞瘤（mixed germ cell tumor）